the history or family history of anaphylaxis, convulsion, epilepsy, encephalopathy and psychosis

The above is a clinical trial exclusion criterion. Annotated with entity spans:
the [Temporal: history] or [Observation: family history] of [Condition: anaphylaxis], [Condition: convulsion], [Condition: epilepsy], [Condition: encephalopathy] and [Condition: psychosis]